感冒高燒不退，主要是因為下列那一腦區的活性被發炎物質干擾所致？
A. preoptic nucleus
B. suprachiasmatic nucleus
C. arcuate nucleus
D. supraoptic nucleus

正確答案：A. preoptic nucleus